Clinical trial inclusion criteria:
Clinically diagnosed autoimmune encephalitis
Ineffective 1st line treatment (e.g. steroid IV, IVIg) and 2nd line treatment (e.g. Rituximab or cyclophosphamide)

Annotated entities:
- Qualifier: "Clinically diagnosed"
- Condition: "autoimmune encephalitis"
- Qualifier: "Ineffective"
- Procedure: "1st line treatment"
- Drug: "steroid IV"
- Drug: "IVIg"
- Procedure: "2nd line treatment"
- Drug: "Rituximab"
- Drug: "cyclophosphamide"